Clinical trial exclusion criteria:
Abdominal and complex cervical cerclage (e.g. bulging bag)
Contraindication to neuraxial anesthesia
Known hypersensitivity to chloroprocaine (a.k.a. Ester allergy), paraaminobenzoic acid (PABA) or bupivacaine (a.k.a. Amide allergy)
Pseudocholinesterase deficiency
Concomitant use with ergot-type oxytocic drugs

Annotated entities:
- Procedure: "cervical cerclage"
- Qualifier: "complex"
- Qualifier: "Abdominal"
- Qualifier: "bulging bag"
- Condition: "Contraindication"
- Procedure: "neuraxial anesthesia"
- Condition: "hypersensitivity"
- Drug: "chloroprocaine"
- Condition: "Ester allergy"
- Drug: "paraaminobenzoic acid"
- Drug: "PABA"
- Drug: "bupivacaine"
- Condition: "Amide allergy"
- Condition: "Pseudocholinesterase deficiency"
- Temporal: "Concomitant"
- Drug: "ergot-type oxytocic drugs"